有關春季角結膜炎（vernal keratoconjunctivitis）的病徵，何者最具有診斷上的意義？
A. 輪部濾泡（limbal follicle）和 Herbert's pit
B. 巨型乳頭狀突起（giant papilla）
C. 結膜結石（lithiasis）
D. 好發於中年人

正確答案：B. 巨型乳頭狀突起（giant papilla）